內頸動脈血管瘤壓迫視交叉的左緣，下列何者的視覺最可能缺損？
A. 右眼之左視野
B. 左眼之左視野
C. 左眼之右視野
D. 右眼之右視野

正確答案：C. 左眼之右視野